下列何種情況最不會導致呼吸道阻力（airway resistance）增加？
A. 吸氣達到肺總量（total lung capacity）
B. 副交感神經興奮
C. 降低肺容積
D. 用力呼氣（forced expiration）

正確答案：A. 吸氣達到肺總量（total lung capacity）